Diagnosis of chronic pain currently taking opioid pain medication or with a history of drug abuse.

The above is a clinical trial exclusion criterion. Annotated with entity spans:
Diagnosis of [Condition: chronic pain] currently taking [Drug: opioid pain medication] or with a [Temporal: history of] [Condition: drug abuse].